Clinical trial inclusion criterion:
6. Laboratory parameters for vital functions should be in the normal range. Laboratory abnormalities that are not clinically significant are generally permitted, except for the following laboratory parameters, which must be within the ranges specified, regardless of clinical significance:

Entity relations:
- Has_value("Laboratory parameters for vital functions", "normal range")